Clinical trial exclusion criterion:
Significant psychological co-morbidity as assessed subjectively by the investigator

Annotated entities:
- Condition: "psychological co-morbidity"
- Qualifier: "Significant"
- Subjective_judgement: "as assessed subjectively by the investigator"